Clinical trial exclusion criterion:
Subjects receiving any other investigational agents.

Annotated entities:
- Context_Error: "Subjects receiving any other investigational agents."